10 歲小孩因頭部受傷送來急診，身體診查發現意識不清，無法遵從指示，對痛刺激才會打開眼睛並縮回手腳（flexion withdrawal），無法對話也不發出聲音。其 Glasgow 昏迷指數為：
A. 4
B. 7
C. 10
D. 12

正確答案：B. 7